History of overdose or suicidal ideation

The above is a clinical trial exclusion criterion. Annotated with entity spans:
History of [Condition: overdose] or [Condition: suicidal ideation]